Clinical trial exclusion criterion:
Height < 4' 11"

Annotated entities:
- Measurement: "Height"
- Value: "< 4' 11""